Clinical trial exclusion criterion:
history of allergic disease or reactions likely to be exacerbated by any component of the vaccine

Annotated entities:
- Condition: "allergic disease"
- Condition: "allergic reactions"
- Qualifier: "exacerbated by any component of the vaccine"
- Procedure: "vaccine"